將麻醉劑注射於坐骨棘（ischial spine）附近，主要影響下列那條神經？
A. 陰部神經
B. 股後皮神經
C. 生殖股神經
D. 髂腹股溝神經

正確答案：A. 陰部神經